慢性阻塞性肺疾併有慢性呼吸衰竭之患者，需要給予氧氣治療時，動脈血液氧氣分壓（PaO2）宜維持在下列何種程度較為合適？
A. 50～55 mmHg
B. 60～65 mmHg
C. 80～85 mmHg
D. 90～95 mmHg

正確答案：B. 60～65 mmHg